Clinical trial exclusion criterion:
Peptic ulcer or reflux esophagitis

Entity relations:
- OR("Peptic ulcer", "reflux esophagitis")